Clinical trial inclusion criterion:
Male, or female, 19 years to 75 years.

Entity relations:
- Has_value("years", "19 years to 75")
- OR("Male", "female")